Type 1 diabetes, gestational diabetes, or secondary forms of diabetes

The above is a clinical trial exclusion criterion. Annotated with entity spans:
[Condition: Type 1 diabetes], [Condition: gestational diabetes], or [Condition: secondary forms of diabetes]